Patients with a history of any other malignancy.

The above is a clinical trial exclusion criterion. Annotated with entity spans:
Patients with a [Temporal: history] of [Qualifier: any other] [Condition: malignancy].